下列何者穿過甲狀舌骨膜（thyrohyoid membrane）？
A. 喉返神經（recurrent laryngeal n.）
B. 喉外神經（external laryngeal n.）
C. 喉下神經（inferior laryngeal n.）
D. 喉內神經（internal laryngeal n.）

正確答案：D. 喉內神經（internal laryngeal n.）